What part of the body is affected by mesotheliomia?

Malignant pleural mesothelioma (MPM) is a hard to treat malignancy arising from the mesothelial surface of the pleura.